靜脈血液通常為缺氧血，但是下列何項例外？
A. 肝靜脈（hepatic vein）
B. 門靜脈（portal vein）
C. 臍靜脈（umbilical vein）
D. 子宮靜脈（uterine vein）

正確答案：C. 臍靜脈（umbilical vein）